Availability to comply with the visits.

The above is a clinical trial inclusion criterion. Annotated with entity spans:
[Non-query-able: Availability to comply with the visits].